1. Subject is a post-menopausal woman, defined as either; six (6) months or more (immediately prior to screening visit) without a menstrual period, or prior hysterectomy and/or oophorectomy

The above is a clinical trial exclusion criterion. Annotated with entity spans:
[Parsing_Error: 1.] Subject is a [Condition: post-menopausal] [Person: woman], defined as either; [Temporal: six (6) months or more] ([Temporal: immediately prior to screening visit]) [Negation: without] a [Condition: menstrual period], or [Temporal: prior] [Procedure: hysterectomy] and/or [Procedure: oophorectomy]